下列那一種 morphine 所產生之反應，最容易發生耐受性？
A. 縮瞳（miosis）
B. 便秘（constipation）
C. 心跳變慢（bradycardia）
D. 呼吸抑制作用（respiratory depression）

正確答案：D. 呼吸抑制作用（respiratory depression）